Clinical trial exclusion criterion:
5. Positive test for any drug included in the urine drug screen.

Annotated entities:
- Context_Error: "Positive test for any drug included in the urine drug screen."
- Parsing_Error: "5."